10 歲男童遭不明蛇類咬傷上肢，患肢在外觀上可見淺小之咬痕，局部無腫脹，下列處理何者正確？
A. 應直接施打抗神經性及抗出血性蛇毒血清
B. 應進行動脈血氧分析
C. 應觀察是否有流涎，眼瞼下垂等狀態
D. 應該給予抗生素治療

正確答案：C. 應觀察是否有流涎，眼瞼下垂等狀態